一位 45 歲女性主管至門診就醫，自訴過去一年經常肚子脹痛，平均每週 2 次，有時會突然發作，趕快去解大便後症狀緩解。她的大便也不太順暢，有時 2～3 天才解一次，但偶而會腹瀉，大便外觀與過去差不多，並無血便現象，食慾尚可，體重也沒有減輕。她也承認這一年來工作壓力較大。關於這位病人之病情，下列敘述何者錯誤？
A. 這位病人可能罹患大腸激躁症（irritable bowel syndrome）
B. 她的症狀很可能是因肛門直腸區域之結構異常所造成
C. 她的病情可能與其壓力有關
D. 由於她腹痛的表現加上大便排泄與腹痛之關聯，表現較不似大腸癌

正確答案：B. 她的症狀很可能是因肛門直腸區域之結構異常所造成